Clinical trial inclusion criterion:
Liver Transplant Recipients have received liver transplantations for at least 6+1 months prior to enrollment

Entity relations:
- Has_index("for at least 6+1 months prior to enrollment", "enrollment")
- Has_temporal("liver transplantations", "for at least 6+1 months prior to enrollment")